La importina interviene en el transporte de proteínas desde el citoplasma a:
1. Núcleo.
2. Retículo endoplásmico.
3. Mitocondria.
4. Peroxisoma.
5. Lisosoma.

Respuesta correcta: 1. Núcleo.